Clinical trial exclusion criterion:
Recent myocardial infarction (within the last 3 months)

Annotated entities:
- Condition: "myocardial infarction"
- Temporal: "the last 3 months"